Clinical trial inclusion criterion:
Organ transplant patients

Annotated entities:
- Procedure: "Organ transplant"